Clinical trial exclusion criterion:
Body mass index (BMI) of 35 kg/m2 or more.

Entity relations:
- Has_value("Body mass index (BMI)", "35 kg/m2 or more")